Clinical trial inclusion criterion:
Person is a K2, K3 or K4 ambulator based on Medicare Functional Classification Level (MFCL).

Entity relations:
- Subsumes("Medicare Functional Classification Level", "MFCL")
- Has_value("Medicare Functional Classification Level", "K2, K3 or K4")